Patients with rectal cancer stage: cT1-2-3, cN0-1, cM0.

The above is a clinical trial inclusion criterion. Annotated with entity spans:
Patients with [Condition: rectal cancer] [Qualifier: stage]: [Measurement: cT][Value: 1-2-3], [Measurement: cN][Value: 0-1], [Measurement: cM][Value: 0].